Clinical trial exclusion criteria:
HCV, HIV, or HDV coinfection.
HCC or other malignancy within 3 years.
Decompensated liver cirrhosis (CTP score = 7).
Uremia patients under hemodialysis or continuous ambulatory peritoneal dialysis or patients with Ccr < 50 mL/min
Pregnant or breastfeeding women.
Women of child-bearing potential (WOCBP) who are unwilling or unable to use an acceptable method of contraception to avoid pregnancy throughout the study and for up to 4 weeks after the last dose of study drug.

Annotated entities:
- Condition: "HCV coinfection"
- Condition: "coinfection HIV"
- Condition: "HDV coinfection"
- Condition: "HCC"
- Condition: "malignancy"
- Temporal: "within 3 years"
- Condition: "Decompensated liver cirrhosis"
- Measurement: "CTP score"
- Value: "= 7"
- Condition: "Uremia"
- Procedure: "hemodialysis"
- Condition: "continuous ambulatory peritoneal dialysis"
- Measurement: "Ccr"
- Value: "< 50 mL/min"
- Pregnancy_considerations: "Pregnant or breastfeeding women"
- Pregnancy_considerations: "Women of child-bearing potential (WOCBP) who are unwilling or unable to use an acceptable method of contraception to avoid pregnancy throughout the study and for up to 4 weeks after the last dose of study drug"